Clinical trial exclusion criterion:
Implanted or irremovable metal in the body (including certain tattoos and permanent make-up)

Entity relations:
- OR("Implanted metal in the body", "irremovable metal in the body")